history of ketoacidosis or metabolic acidosis

The above is a clinical trial exclusion criterion. Annotated with entity spans:
history of [Condition: ketoacidosis] or [Condition: metabolic acidosis]